先天性橫膈膜疝氣（congenital diaphragmatic hernia），最有可能併發的嚴重問題為何？
A. 肺臟發育不全（pulmonary hypoplasia）
B. 先天性心臟病（congenital heart disease）
C. 食道閉鎖氣管食道廔管（esophageal atresia with tracheoesophageal fistula）
D. 後鼻孔閉鎖 （choanal atresia）

正確答案：A. 肺臟發育不全（pulmonary hypoplasia）